Clinical trial exclusion criterion:
Women who are pregnant or breastfeeding

Entity relations:
- OR("pregnant", "breastfeeding")